Clinical trial inclusion criterion:
20-40 years old women

Annotated entities:
- Value: "20-40 years"
- Person: "old"
- Person: "women"